Clinical trial exclusion criterion:
Use of medications that alter the absorption or metabolism of levothyroxine

Annotated entities:
- Drug: "medications"
- Observation: "metabolism of levothyroxine"
- Drug: "levothyroxine"
- Observation: "absorption of levothyroxine"
- Negation: "alter"